在自由社會始終會有些人從事危險性行為或有害健康的生活型態，如何面對並採取實際方法減低其所導致的傷害，即減害的觀點，在物質濫用的防制中，下列那一項不是國內外政府機構規劃實行的減害措施？
A. 執行反毒教育宣導、尿液篩檢與強制藥物勒戒
B. 提供美沙冬（合成的長效口服鴉片類藥物）替代療法
C. 非法藥物除罪化（特別是大麻），由醫療專業人員督導藥物注射
D. 針頭交換計畫以提高藥癮者接觸乾淨針頭及注射器材管道

正確答案：A. 執行反毒教育宣導、尿液篩檢與強制藥物勒戒